Chronic HCV Infection of Genotype 1, 4, 5, or 6

The above is a clinical trial inclusion criterion. Annotated with entity spans:
[Condition: Chronic HCV Infection] of [Qualifier: Genotype] 1, 4, 5, or 6